Clinical trial exclusion criterion:
Smoking by subject or other person in the subject's bedroom, or other open flame in bedroom

Annotated entities:
- Non-query-able: "Smoking by subject or other person in the subject's bedroom, or other open flame in bedroom"